9. Use of tobacco products and/or history of smoking within the past 2 months

The above is a clinical trial exclusion criterion. Annotated with entity spans:
[Parsing_Error: 9.] Use of [Drug: tobacco products] and/or [Temporal: history] of [Observation: smoking] [Temporal: within the past 2 months]